How does LB-100 affect the DDR proteins (BRCA1, Chk2, and γH2AX)?

LB100 induced constitutive hyperphosphorylation of DDR proteins (BRCA1, Chk2, and gH2AX).